Clinical trial exclusion criterion:
Relative contraindications to ECT therapy (recent MI or CVA, increased intracranial pressure, intracranial mass lesion, intracranial aneurysm, epilepsy, known cardiac arrhythmia, pheochromocytoma, pregnancy)

Entity relations:
- AND("Relative contraindications", "ECT therapy")
- Has_temporal("MI", "recent")
- Has_value("intracranial pressure", "increased")
- Subsumes("Relative contraindications", "MI")
- OR("MI", "CVA")
- OR("MI", "pheochromocytoma", "cardiac arrhythmia", "epilepsy", "intracranial aneurysm", "intracranial mass lesion", "intracranial pressure", "pregnancy")